Clinical trial inclusion criterion:
If female and of childbearing potential, are willing to use adequate contraception (hormonal, barrier method, abstinence) prior to study entry and for the duration of study participation.

Entity relations:
- Subsumes("contraception", "hormonal")
- AND("willing to", "contraception")
- Has_context("female", "willing to")
- Has_temporal("contraception", "prior to study entry")
- Has_temporal("contraception", "for the duration of study participation")
- Has_index("prior to study entry", "study entry")
- Has_index("for the duration of study participation", "study participation")
- Has_context("childbearing potential", "willing to")
- OR("hormonal", "barrier method", "abstinence")